¿Cuál de los siguientes tipos celulares produce testosterona?
1. Células de Sertoli.
2. Células de Leydig.
3. Células mioides.
4. Espermatogonias.

Respuesta correcta: 2. Células de Leydig.